Family have a freezer in which to safely store the test meals.

The above is a clinical trial inclusion criterion. Annotated with entity spans:
[Non-query-able: Family have a freezer in which to safely store the test meals].